Clinical trial inclusion criterion:
Patient contact lens refraction should fit within the available parameters of the study lenses.

Annotated entities:
- Non-query-able: "Patient contact lens refraction should fit within the available parameters of the study lenses."
- Context_Error: "Patient contact lens refraction should fit within the available parameters of the study lenses."